Malignancy including leukemia and lymphoma within the last 5y.

The above is a clinical trial exclusion criterion. Annotated with entity spans:
[Condition: Malignancy] including [Condition: leukemia] and [Condition: lymphoma] [Temporal: within the last 5y].